Clinical trial exclusion criteria:
ASA> 3;
Coagulopathy;
Renal disease,
Liver disease,
History of recent gastro-intestinal bleeding
Pregnancy.
Diagnosis of chronic pain currently taking opioid pain medication or with a history of drug abuse.
Patients with a self-described allergy to ASA, acetaminophen, NSAIDS and codeine.
All patients receiving a brachial plexus block for anesthesia and/or analgesia

Annotated entities:
- Measurement: "ASA"
- Value: "> 3"
- Condition: "Coagulopathy"
- Condition: "Renal disease"
- Condition: "Liver disease"
- Condition: "gastro-intestinal bleeding"
- Temporal: "recent"
- Condition: "Pregnancy"
- Condition: "chronic pain"
- Drug: "opioid pain medication"
- Temporal: "history of"
- Condition: "drug abuse"
- Condition: "allergy"
- Drug: "ASA"
- Drug: "acetaminophen"
- Drug: "NSAIDS"
- Drug: "codeine"
- Procedure: "brachial plexus block"